40 歲男性愛滋病患在追蹤過程中發現腎臟的功能惡化。二十四小時尿蛋白高達 10 克。血清學檢查並未發現 C 或 B 型肝炎病毒抗體。腎臟生檢展現腎絲球足細胞（visceral podocytes）增殖及局部腎絲球塌陷。下列疾病中那一個最符合其臨床及病理表現？
A. Focal segmental glomerulosclerosis
B. Diffuse crescentic glomerulonephritis
C. Membranoproliferative glomerulonephritis
D. Minimal change nephropathy

正確答案：A. Focal segmental glomerulosclerosis